下列何者非類風濕性結節（rheumatoid nodules）好發的部位？
A. 關節附近的位置
B. 四肢的伸側表面
C. 經常遭受壓力衝擊的部位
D. 曾經有過皮膚外傷及其附近的部位

正確答案：D. 曾經有過皮膚外傷及其附近的部位